En el músculo esquelético, tienen capacidad de regeneración, aunque limitada, las células:
1. De menor tamaño.
2. Satélite.
3. Fibroblastos del endomisio.
4. De la glía de las placas motoras.
5. Cualquiera.

Respuesta correcta: 2. Satélite.